Clinical trial inclusion criterion:
a crown-rump length <6mm and no fetal growth at least one week later OR

Annotated entities:
- Measurement: "crown-rump length"
- Value: "<6mm"
- Negation: "no"
- Observation: "fetal growth"
- Temporal: "at least one week later"